Clinical trial inclusion criterion:
ECOG performance status 0-2,Child pugh A or B

Entity relations:
- Has_value("Child pugh", "A")
- Has_value("ECOG performance status", "0-2")
- OR("A", "B")